乾癬性關節炎（psoriatic arthritis）與下列何者有關？
A. 血清中有類風濕因子的存在
B. 常會引起遠端指間關節（distal interphalangeal joint）的發炎
C. 不會引起脊椎炎
D. 與 HLA-DR2 有很強的相關性

正確答案：B. 常會引起遠端指間關節（distal interphalangeal joint）的發炎